hypersensitivity or contraindication to one of the study drugs

The above is a clinical trial exclusion criterion. Annotated with entity spans:
[Condition: hypersensitivity] or [Condition: contraindication] to [Multiplier: one of] the [Drug: study drugs]